Clinical trial exclusion criterion:
Known severe hepatic dysfunction

Annotated entities:
- Condition: "hepatic dysfunction"
- Qualifier: "severe"